Participation in another investigational trial within 90 days

The above is a clinical trial exclusion criterion. Annotated with entity spans:
[Non-query-able: Participation in another investigational trial within 90 days]